Clinical trial inclusion criterion:
2. Male or female ≥ 18 years of age.

Annotated entities:
- Person: "Male"
- Person: "female"
- Value: "≥ 18 years"
- Person: "age"